Severe renal impairment (Class 3 or worse kidney disease)

The above is a clinical trial exclusion criterion. Annotated with entity spans:
[Condition: Severe renal impairment] ([Parsing_Error: Class 3 or worse kidney disease])